Clinical trial exclusion criterion:
concomitant physical therapy

Annotated entities:
- Procedure: "physical therapy"
- Temporal: "concomitant"